What is particular about the 3D structure of the inactive X chromosome?

The mammalian inactive X chromosome (Xi) condenses into a bipartite structure with two superdomains of frequent long-range contacts, separated by a hinge region.